Clinical trial inclusion criterion:
Prior Myocardial Infarction and

Annotated entities:
- Condition: "Myocardial Infarction"